Cuál de los pasos siguientes de la biosíntesis de colesterol es el que controla la velocidad y el lugar de regulación metabólica:
1. Geranil pirofosfato Farnesil pirofosfato.
2. Escualeno  Lanosterol
3. Lanosterol  Colesterol.
4. Acetil CoA  Acetoacetil CoA.
5. 3-Hidroxi-3-metilglutaril  CoA         Ácido mevalónico.

Respuesta correcta: 5. 3-Hidroxi-3-metilglutaril  CoA         Ácido mevalónico.